早產兒最常見之腦出血為何？
A. 腦室周圍原生質腦室內出血（germinal matrix intraventricular hemorrhage）
B. 腦實質出血（parenchymal hemorrhage）
C. 小腦出血（cerebellar hemorrhage）
D. 腦幹出血（brain stem hemorrhage）

正確答案：A. 腦室周圍原生質腦室內出血（germinal matrix intraventricular hemorrhage）